Prior treatment with CPAP.

The above is a clinical trial exclusion criterion. Annotated with entity spans:
[Temporal: Prior] treatment with [Procedure: CPAP].